Active alcohol or drug use or dependence which may interfere with adherence to study requirements

The above is a clinical trial exclusion criterion. Annotated with entity spans:
[Intoxication_considerations: Active alcohol or drug use or dependence which may interfere with adherence to study requirements]